有關抗生素的使用，下列敘述何者錯誤？
A. 不當的使用抗生素會增加細菌抗藥性的產生，以及巨大的醫療浪費
B. 不當的使用抗生素會增加病患的死亡率及副作用
C. 抗生素之選用必須依病人年齡、免疫情況、代謝情況、營養情況、水和電解質平衡、肝和腎功能、病情嚴重程度等而調整
D. 抗生素藥物劑量濃度高低與細菌是否產生抗藥性無關

正確答案：D. 抗生素藥物劑量濃度高低與細菌是否產生抗藥性無關